亞急性合併退化症（subacute combined degeneration）不會伴隨下列何種情況？
A. 大紅血球性貧血（macrocytic anemia）
B. 震動覺遲鈍（impaired vibration sense）
C. 腦脊髓液中白血球增加（pleocytosis）
D. 多發性周邊神經病變（polyneuropathy）

正確答案：C. 腦脊髓液中白血球增加（pleocytosis）